Clinical trial exclusion criteria:
coagulopathy
allergy to to local anesthetics
depression, antidepressant drugs treatment
epilepsy
usage of painkiller before surgery
addiction to alcohol or recreational drugs

Annotated entities:
- Condition: "coagulopathy"
- Condition: "allergy"
- Drug: "local anesthetics"
- Condition: "depression"
- Drug: "antidepressant drugs"
- Condition: "epilepsy"
- Drug: "painkiller"
- Temporal: "before surgery"
- Condition: "addiction to alcohol"
- Condition: "addiction to recreational drugs"